La paratimia se caracteriza porque:
1. Se han perdido la flexibilidad y modulación emocional o afectiva.
2. Hay sentimientos mixtos de amor-odio.
3. Hay cambios rápidos de humor.
4. Hay ausencia de control sobre la expresión de los afectos.
5. La expresión afectiva es discordante o inadecuada con la situación.

Respuesta correcta: 5. La expresión afectiva es discordante o inadecuada con la situación.